Clinical trial inclusion criterion:
If taking cognitive enhancers (donepezil, rivastigmine, memantine, galantamine), must be on stable dose at least 30 days prior to screening, and be expected to remain on a stable dose for the duration of the study.

Entity relations:
- Subsumes("cognitive enhancers", "donepezil")
- Has_qualifier("cognitive enhancers", "stable dose")
- Has_temporal("cognitive enhancers", "at least 30 days prior to screening")
- Has_index("at least 30 days prior to screening", "screening")
- OR("donepezil", "rivastigmine", "memantine", "galantamine")